What is the asosciation between the eustachian tube and the palatine muscle of the uvula?

Palatal musculature is known to be responsible for the active opening of the eustachian  tube.